Clinical trial exclusion criterion:
A previous history of intolerance to the study drug or related compounds and additives

Entity relations:
- AND("intolerance", "study drug")
- Has_temporal("intolerance", "previous history")
- OR("study drug", "related compounds")